Respecto a la taxonomía de NANDA-I, es correcto afirmar que:
1. Todos los diagnósticos contenidos en la taxonomía son apropiados para todas las enfermeras en ejercicio.
2. Todos los diagnósticos propuestos son pertinentes para todas las especialidades.
3. Hay diagnósticos que pueden estar fuera del ámbito de ejercicio que rige la práctica enfermera de una zona específica.
4. La utilización de los diagnósticos contenidos en la clasificación avala su utilización por encima de los reglamentos que pudieran existir en un ámbito concreto.
5. La taxonomía debe ajustarse a cada realidad, retirando aquellos diagnósticos que no sean habituales e incluyendo los que no figuren en la clasificación y representen problemas comunes.

Respuesta correcta: 3. Hay diagnósticos que pueden estar fuera del ámbito de ejercicio que rige la práctica enfermera de una zona específica.